Clinical trial exclusion criterion:
Contraindication to spinal anesthesia

Entity relations:
- AND("Contraindication", "spinal anesthesia")